Clinical trial inclusion criterion:
Seronegative for antibodies against insulin, islet cells and glutamic acid decarboxylase (GAD);

Entity relations:
- Has_qualifier("antibodies", "insulin")
- Has_negation("antibodies", "Seronegative")
- OR("insulin", "glutamic acid decarboxylase (GAD)", "islet cells")